雷射虹膜穿孔術（laser iridotomy）不適用於下列那一類型的青光眼？
A. 急性隅角閉鎖型青光眼
B. 慢性隅角閉鎖型青光眼
C. 未發作之對側隅角狹窄的眼睛
D. 原發性隅角開放型青光眼

正確答案：D. 原發性隅角開放型青光眼